En relación al crecimiento bacteriano en medio líquido no renovado, ¿cuál de las siguientes afirmaciones es la correcta?
1. El tiempo de generación es un parámetro constante.
2. La fase de crecimiento exponencial es perpetua.
3. Existe una relación directa entre la velocidad específica de crecimiento y el tiempo de generación.
4. Existe una relación inversa entre la velocidad específica de crecimiento y el tiempo de generación.
5. El tiempo de generación y la velocidad específica de crecimiento no están relacionados.

Respuesta correcta: 4. Existe una relación inversa entre la velocidad específica de crecimiento y el tiempo de generación.